一位 53 歲女士在健康檢查時被發現白血球為 23,500/mm3，分類如下：promyelocyte 0.5%，myelocyte  5%，metamyelocyte 5%，banded neutrophil 16.5%，segmented neutrophil 53.5%，lymphocyte 15%， monocyte 3%，eosinophil 2.5%，basophil 1.5%；血紅素及血小板正常。骨髓細胞染色體檢查有 t(9;22)(q34;q11)。下列何者為此女士最適當的治療方式？
A. Hydroxyurea
B. α-Interferon
C. Imatinib
D. hematopoietic stem cell transplantation

正確答案：C. Imatinib